Clinical trial exclusion criterion:
Currently smokes tobacco (cigarettes)

Annotated entities:
- Observation: "smokes tobacco"
- Observation: "smokes cigarettes"